Clinical trial inclusion criterion:
Able to ingest oral diet

Annotated entities:
- Condition: "Able to ingest oral diet"
- Non-query-able: "Able to ingest oral diet"